Clinical trial exclusion criterion:
Patient with severe proctitis (MAYO score ≥ 11 at inclusion).

Annotated entities:
- Condition: "proctitis"
- Qualifier: "severe"
- Measurement: "MAYO score"
- Value: "≥ 11"
- Temporal: "at inclusion"